6. Signed informed consent

The above is a clinical trial inclusion criterion. Annotated with entity spans:
[Parsing_Error: 6.] [Post-eligibility: Signed informed consent]